Clinical trial inclusion criterion:
Infants in the newborn intensive care unit

Annotated entities:
- Visit: "newborn intensive care unit"
- Person: "Infants"